65歲女性素食者來門診，主訴漸進性步態不穩6個月，血液檢查發現維生素B12（Vitamin B12）偏低，神經學檢查發現膝反射和踝反射增強，陽性巴賓斯基氏徵象（positive Babinski sign），下肢振動覺和位置覺受損，神經傳導檢查出現周圍神經病變，其診斷最可能為何？
A. 前額葉腦中風
B. 中腦中風
C. 梅毒脊髓症
D. 亞急性聯合變性（subacute combined degeneration）

正確答案：D. 亞急性聯合變性（subacute combined degeneration）